Eastern Cooperative Oncology Group (ECOG) performance status of 0 - 2

The above is a clinical trial inclusion criterion. Annotated with entity spans:
[Measurement: Eastern Cooperative Oncology Group] ([Measurement: ECOG]) performance status of [Value: 0 - 2]